Clinical trial exclusion criteria:
Patients with 2 or more doses of methylprednisolone/prednisone per day
Steroids other than methylprednisolone or prednisone
Pregnancy
estimated glomerular filtration rate (eGFR) < 45 ml/min/1.73m2

Annotated entities:
- Multiplier: "2 or more doses per day"
- Drug: "methylprednisolone"
- Drug: "prednisone"
- Drug: "methylprednisolone"
- Drug: "prednisone"
- Drug: "Steroids"
- Negation: "other than"
- Condition: "Pregnancy"
- Measurement: "estimated glomerular filtration rate (eGFR)"
- Value: "< 45 ml/min/1.73m2"